Clinical trial inclusion criterion:
M1 marrow on day 33.

Annotated entities:
- Line: "M1 marrow on day 33."
- Condition: "M1 marrow"
- Temporal: "on day 33"